左耳正常，但右耳罹患慢性中耳炎（氣骨導差值為 30dB）的病人，給予進行音叉測驗，結果可見：
A. 右耳 Rinne test 呈陽性，Weber test 朝向右側
B. 右耳 Rinne test 呈陽性，Weber test 朝向左側
C. 右耳 Rinne test 呈陰性，Weber test 朝向右側
D. 右耳 Rinne test 呈陰性，Weber test 朝向左側

正確答案：C. 右耳 Rinne test 呈陰性，Weber test 朝向右側